Clinical trial exclusion criterion:
8. Left main stenosis of 50% or more;

Annotated entities:
- Condition: "Left main stenosis"
- Value: "50% or more"